Clinical trial inclusion criterion:
Willingness and ability to comply with scheduled visits, treatment plans and any other study procedures

Annotated entities:
- Post-eligibility: "Willingness and ability to comply with scheduled visits, treatment plans and any other study procedures"